Clinical trial exclusion criteria:
Diabetes Mellitus
Acute coronary syndrome in the past 6 months
Cardiac arrhythmias (2nd and 3rd degree heart block or premature ventricular complexes in Lown classes 4 or 5)
Symptoms suggestive of obstructive or central sleep apnea (with a score of > 10 on Epworth sleepiness scale)
Patients taking Clonidine
Body mass index (BMI) > 34
Patients unable to give consent
Pregnant women
Patients with leg injury involving nerve damage
Patients taking anticoagulant medication
Patients with significant bleeding disorder or liver disorder
Hemoglobin <1.05 g/dl at the time of initiation of therapy
patients with unilateral or bilateral nephrectomy
Planned kidney transplant in the next 4 months
Life expectancy under 6 months
Oliguria (urine output less than 400 ml per day)

Annotated entities:
- Condition: "Diabetes Mellitus"
- Condition: "Acute coronary syndrome"
- Temporal: "in the past 6 months"
- Condition: "Cardiac arrhythmia"
- Condition: "3rd degree heart block"
- Condition: "2nd degree heart block"
- Condition: "premature ventricular complexes"
- Qualifier: "Lown classes 4"
- Qualifier: "Lown classes 5"
- Condition: "obstructive sleep apnea"
- Condition: "central sleep apnea"
- Measurement: "Epworth sleepiness scale"
- Value: "score of > 10"
- Drug: "Clonidine"
- Measurement: "Body mass index"
- Measurement: "BMI"
- Value: "> 34"
- Informed_consent: "Patients unable to give consent"
- Pregnancy_considerations: "Pregnant women"
- Condition: "leg injury"
- Condition: "nerve damage"
- Drug: "anticoagulant"
- Condition: "bleeding disorder"
- Condition: "liver disorder"
- Qualifier: "significant"
- Measurement: "Hemoglobin"
- Value: "<1.05 g/dl"
- Temporal: "at the time of initiation of therapy"
- Reference_point: "initiation of therapy"
- Procedure: "nephrectomy"
- Qualifier: "bilateral"
- Qualifier: "unilateral"
- Condition: "kidney transplant"
- Qualifier: "Planned"
- Temporal: "in the next 4 months"
- Observation: "Life expectancy"
- Value: "under 6 months"
- Condition: "Oliguria"
- Measurement: "urine output"
- Value: "less than 400 ml per day"